TBS with major arterial bleeding requiring suture or mechanical ligation;

The above is a clinical trial exclusion criterion. Annotated with entity spans:
[Condition: TBS] with [Condition: major arterial bleeding] requiring [Procedure: suture] or [Procedure: mechanical ligation];